Clinical trial inclusion criterion:
Adult (age 18 years and older)

Annotated entities:
- Person: "Adult"
- Person: "age"
- Value: "18 years and older"